Clinical trial exclusion criterion:
Patients with a contraindication to VCE (small bowel strictures, oropharyngeal dysphagia, pregnancy, patients who are not surgical candidates)

Entity relations:
- AND("contraindication", "VCE")
- Has_negation("surgical candidates", "not")
- Subsumes("contraindication", "small bowel strictures")
- OR("small bowel strictures", "oropharyngeal dysphagia", "surgical candidates", "pregnancy")